Clinical trial exclusion criteria:
Patients with a history of allergy or hypersensitivity to tramadol.
History of epilepsy or convulsions due to any reason.
Chronic usage of analgesic drugs.
Patients using monoamine oxidase inhibitors.
Patients with clinical signs of raised ICP.
Obesity (women with a body mass index >35 kg/m2 or men with a body mass index >42 kg/m2)
Language barrier.
Patients taking B-blockers or Ca channel blockers.
Patients above 65 years of age ( Physiology difference)

Annotated entities:
- Condition: "allergy"
- Condition: "hypersensitivity"
- Drug: "tramadol"
- Condition: "epilepsy"
- Condition: "convulsions"
- Drug: "analgesic drugs"
- Drug: "monoamine oxidase inhibitors"
- Measurement: "ICP"
- Value: "raised"
- Condition: "Obesity"
- Person: "women"
- Measurement: "body mass index"
- Value: ">35 kg/m2"
- Person: "men"
- Measurement: "body mass index"
- Value: ">42 kg/m2"
- Post-eligibility: "Language barrier"
- Drug: "Ca channel blockers"
- Drug: "B-blockers"
- Person: "age"
- Value: "above 65 years"